下列那一種原始性反射（primitive reflex），出現後會終生存在？
A. Moro reflex
B. Palmar grasp
C. Landau reflex
D. Parachute response

正確答案：D. Parachute response